Clinical trial inclusion criterion:
MADRS total score of 18 or higher

Annotated entities:
- Measurement: "MADRS"
- Value: "score of 18 or higher"